60 歲停經婦女問荷爾蒙療法（HT）的好處，除了緩解熱潮紅、骨質流失與陰道萎縮外，可以減少那個疾病的發生？
A. 大腸癌
B. 風濕性關節炎
C. 偏頭痛
D. 膽結石

正確答案：A. 大腸癌